Clinical trial inclusion criterion:
Absolute neutrophil count (ANC) >1,500/microL and platelets >100,000/microL (≤72 hours prior to initial treatment).

Entity relations:
- multi("≤72 hours prior to initial treatment", "initial treatment")
- Has_value("platelets", ">100,000/microL")
- Has_value("Absolute neutrophil count (ANC)", ">1,500/microL")
- Has_temporal("Absolute neutrophil count (ANC)", "≤72 hours prior to initial treatment")
- Has_temporal("platelets", "≤72 hours prior to initial treatment")